Clinical trial inclusion criterion:
Body mass index to be between 18 to 30 kg/m2 (inclusive) as calculated by weight(Kg)/height(m2).

Annotated entities:
- Measurement: "Body mass index"
- Value: "between 18 to 30 kg/m2"